1. Subjects must have recurrent or persistent platinum-resistant epithelial ovarian, fallopian tube, or primary peritoneal carcinoma with measureable disease (as defined by RECIST 1.1.) after first or second line platinum-based chemotherapy, for which treatment with PLD is indicated. Platinum-based therapy is defined as treatment with carboplatin, cisplatin or another organoplatinum compound. Platinum-resistant is defined as having a platinum-free interval (PFI) of < 12 months after first- or second-line platinum-based chemotherapy, or having disease progression while receiving second-line platinum-based chemotherapy.

The above is a clinical trial inclusion criterion. Annotated with entity spans:
[Parsing_Error: 1.] Subjects must have [Qualifier: recurrent] or [Qualifier: persistent] [Qualifier: platinum-resistant] epithelial ovarian, fallopian tube, or [Condition: primary peritoneal carcinoma] with [Condition: measureable disease] (as defined by RECIST 1.1.) [Temporal: after first] or [Reference_point: second line platinum-based chemotherapy], for which [Procedure: treatment with PLD] is [Qualifier: indicated]. [Not_a_criteria: Platinum-based therapy is defined as treatment with carboplatin, cisplatin or another organoplatinum compound.] [Condition: Platinum-resistant] is defined as having a [Measurement: platinum-free interval (PFI)] of [Temporal: < 12 months after first- or second-line platinum-based chemotherapy], or having [Condition: disease progression] while receiving [Procedure: second-line platinum-based chemotherapy].